Clinical trial exclusion criterion:
patients with heart, liver, or renal function impairment;presence of severe infections or cerebrovascular disease;

Entity relations:
- Has_qualifier("infections", "severe")
- OR("heart function impairment", "renal function impairment", "infections", "liver function impairment")
- OR("infections", "cerebrovascular disease")